El lactógeno placentario tiene efectos equivalentes a:
1. GH
2. Insulina.
3. Oxitocina.
4. Estrógenos.
5. FSH.

Respuesta correcta: 1. GH